Clinical trial inclusion criterion:
normal blood pressure or controlled hypertension;

Annotated entities:
- Condition: "normal blood pressure"
- Condition: "controlled hypertension"